history of gastrectomy,

The above is a clinical trial inclusion criterion. Annotated with entity spans:
[Temporal: history] of [Procedure: gastrectomy],